Local or systemic drug use which interacts with the outcome measures.

The above is a clinical trial exclusion criterion. Annotated with entity spans:
[Qualifier: Local] or [Qualifier: systemic] [Drug: drug] use which [Qualifier: interacts with the outcome measures].